Clinical trial exclusion criterion:
previous gastric surgery

Annotated entities:
- Temporal: "previous"
- Procedure: "gastric surgery"